Age > 40 years (45)

The above is a clinical trial inclusion criterion. Annotated with entity spans:
[Person: Age] [Value: > 40 years] (45)